Clinical trial inclusion criteria:
age =18 and <75 years;
patients with stable coronary artery disease referred to PCI in an artery suitable for IVUS pullback;
signed informed consent before PCI.

Annotated entities:
- Person: "age"
- Value: "=18 and <75 years"
- Qualifier: "stable"
- Condition: "coronary artery disease"
- Procedure: "PCI"
- Mood: "referred to"
- Qualifier: "artery suitable for IVUS pullback"
- Informed_consent: "signed informed consent before PCI"